Clinical trial inclusion criterion:
Liver function: transaminase=2.5× upper limit of normal value,bilirubin=1.5×upper limit of normal value;

Entity relations:
- Has_value("transaminase", "=2.5× upper limit of normal value")
- Has_value("bilirubin", "=1.5×upper limit of normal value")